Liver cirrhosis (Child-Pugh all stages)

The above is a clinical trial exclusion criterion. Annotated with entity spans:
[Condition: Liver cirrhosis] ([Measurement: Child-Pugh] [Value: all stages])